The existence of subretinal hemorrhage area constituting =50% of total lesion area

The above is a clinical trial exclusion criterion. Annotated with entity spans:
The existence of [Measurement: subretinal hemorrhage area] constituting [Value: =50% of total lesion area]